Clinical trial inclusion criterion:
Having been diagnosed with primary OCD as defined by the Diagnostic and Statistical Manual of Mental Disorders (DSM-IV-) criteria;Cleaning or checking as primary OCD symptoms

Entity relations:
- Subsumes("Diagnostic and Statistical Manual of Mental Disorders", "DSM-IV")
- AND("Diagnostic and Statistical Manual of Mental Disorders", "primary OCD")